Current HAART use for HIV, long term use of immunosuppressants (e.g. steroids, chemotherapy, TNF-inhibitors and related agents)

The above is a clinical trial exclusion criterion. Annotated with entity spans:
Current [Procedure: HAART] use for [Condition: HIV], [Multiplier: long term use] of [Drug: immunosuppressants] (e.g. [Drug: steroids], [Drug: chemotherapy], [Drug: TNF-inhibitors] and related agents)